下列何者是選殖質體（cloning plasmids）的正確描述？
A. 在大腸桿菌 DNA 複製（replication）時，環狀質體（circular plasmids）不需要複製起點（origin of
B. 可用以選殖約 50 Kb 鹼基對（kilo-base pairs）的外來 DNA
C. 通常不需抗生素抗藥性基因（antibiotic resistant gene）
D. 需要特定限制酶切點（unique restriction enzyme site）以供選殖外來 DNA 之用

正確答案：D. 需要特定限制酶切點（unique restriction enzyme site）以供選殖外來 DNA 之用